Patients with any neoplasm except localized skin cancer and who is receiving adequate treatment.

The above is a clinical trial exclusion criterion. Annotated with entity spans:
Patients with any [Condition: neoplasm] [Negation: except] [Condition: localized skin cancer] and who is receiving adequate treatment.